Clinical trial exclusion criterion:
preoperative use of opioid drugs (excl. codeine, tramadol)

Entity relations:
- Has_negation("codeine", "excl.")
- AND("opioid drugs", "codeine")
- Has_temporal("opioid drugs", "preoperative")
- OR("codeine", "tramadol")